你若為胸腔外科醫師正在作肺部手術，則以下觀察何者正確？
A. 右主支氣管之長度比左主支氣管短
B. 左肺有三葉，右肺有二葉
C. 異物較易進入左側支氣管
D. 成人氣管長度約 25 公分

正確答案：A. 右主支氣管之長度比左主支氣管短